Clinical trial exclusion criterion:
Contraindication to progestin-only contraceptives

Annotated entities:
- Non-query-able: "Contraindication"
- Procedure: "contraceptives"
- Drug: "progestin"
- Qualifier: "only"